What alternate indication has Vanoxerine been repositioned for?

vanoxerine's were strongly frequency-dependent and repositioned it for treatment of atrial fibrillation and flutter. . has been in clinical trials for parkinsonism , depression and cocaine addiction but lacked efficacy. .